Clinical trial exclusion criterion:
Corrected visual acuity < 20/70; Color blindness.

Annotated entities:
- Measurement: "visual acuity"
- Qualifier: "Corrected"
- Value: "< 20/70;"
- Condition: "Color blindness"